Clinical trial exclusion criterion:
majors clinical conditions

Annotated entities:
- Condition: "majors clinical conditions"